Clinical trial exclusion criterion:
Have used drugs for weight loss within 1 month of screening.

Entity relations:
- Has_temporal("drugs for weight loss", "within 1 month of screening")